Clinical trial inclusion criterion:
All patients admitted to the ICU in septic shock

Annotated entities:
- Procedure: "admitted"
- Visit: "ICU"
- Condition: "septic shock"